Clinical trial exclusion criterion:
age <18 years;

Annotated entities:
- Person: "age"
- Value: "<18 years"